Clinical trial exclusion criterion:
Preoperative recent history of opioid or alcohol abuse

Annotated entities:
- Temporal: "Preoperative"
- Temporal: "recent"
- Temporal: "history"
- Condition: "alcohol abuse"
- Condition: "opioid abuse"